What is the origin of XUT transcripts in yeast?

XUTs are a class of Xrn1-sensitive antisense regulatory non-coding RNA in yeast